Clinical trial inclusion criterion:
Patient is 20 to 70 years of age

Entity relations:
- Has_value("age", "20 to 70 years")